Clinical trial exclusion criterion:
Severe male factor infertility (Total motile sperm count < 5 million/ml and/or normal WHO morphology <20%).

Entity relations:
- Has_qualifier("male factor infertility", "Severe")
- Has_value("Total motile sperm count", "< 5 million/ml")
- Has_value("normal WHO morphology", "<20%")
- Subsumes("male factor infertility", "Total motile sperm count")
- OR("Total motile sperm count", "normal WHO morphology")